Clinical trial inclusion criterion:
At least six (6) weeks of failed, conservative treatment prior to surgery, or requires immediate surgery to prevent permanent disability.

Annotated entities:
- Multiplier: "At least six (6) weeks"
- Qualifier: "failed"
- Qualifier: "conservative"
- Procedure: "treatment"
- Temporal: "prior to surgery"
- Procedure: "surgery"
- Condition: "permanent disability"
- Mood: "prevent"
- Qualifier: "immediate"